以下何種兒童腎絲球腎炎通常血清第三補體（C3）不會降低？
A. 過敏性紫斑腎炎（anaphylactoid purpura nephritis）
B. 狼瘡性腎炎（lupus nephritis）
C. 膜性增生性腎絲球腎炎（membranoproliferative glomerulonephritis）
D. 細菌性心內膜炎（bacterial endocarditis）引發腎絲球腎炎

正確答案：A. 過敏性紫斑腎炎（anaphylactoid purpura nephritis）